關於動脈粥樣硬化之頸動脈狹窄（carotid stenosis）的敘述，下列何者錯誤？
A. 導管血管攝影檢查是篩選高風險病患最安全的方法
B. 與抽菸及高血壓有關
C. 頭頸部癌症病患接受放射治療，也會增加其發生率
D. 可以藥物、外科手術或支架置放治療

正確答案：A. 導管血管攝影檢查是篩選高風險病患最安全的方法